En cuanto a la poliposis intestinal, ¿cuál de los siguientes síndromes NO es hereditario?
1. Síndrome de Gardner.
2. Síndrome de Cronkhite-Canada.
3. Síndrome de Turcot.
4. Poliposis juvenil.
5. Síndrome de Peutz-Jeghers.

Respuesta correcta: 2. Síndrome de Cronkhite-Canada.